pregnancy or lactation

The above is a clinical trial exclusion criterion. Annotated with entity spans:
[Pregnancy_considerations: pregnancy or lactation]